一位38歲男性因性功能障礙求診，抽血檢查結果，testosterone濃度為1.5 ng/mL（正常值為3～8 ng/mL）， prolactin濃度為150 ng/mL（正常成年男性為＜20 ng/mL）。下列何者是最不可能造成此性功能障礙的原因？
A. 服用抑制dopamine分泌的藥物
B. 在腦下腺（pituitary gland）長了腫瘤
C. 在下視丘（hypothalamus）接近腦下腺（pituitary gland）處長了腫瘤
D. 隱睪症（cryptorchidism）

正確答案：D. 隱睪症（cryptorchidism）